Clinical trial exclusion criterion:
2. For subjects in Cohort B: previous therapy for more than 48 hours with any parenteral antibiotic with activity against MRSA, except vancomycin and/or daptomycin, within 72 hours of positive blood culture results confirming persistence.

Entity relations:
- Has_temporal("therapy", "previous")
- Has_temporal("therapy", "for more than 48 hours")
- Has_negation("vancomycin", "except")
- Has_negation("daptomycin", "except")
- Has_value("blood culture", "positive results")
- Has_temporal("vancomycin", "within 72 hours of positive blood culture results")
- AND("Cohort B", "therapy")
- Has_index("within 72 hours of positive blood culture results", "positive blood culture results")
- Has_temporal("daptomycin", "within 72 hours of positive blood culture results")
- AND("Cohort B", "parenteral antibiotic with activity against MRSA")
- Has_qualifier("Cohort B", "parenteral")
- Has_qualifier("Cohort B", "with activity against MRSA")
- Has_context("Cohort B", "MRSA")
- AND("Cohort B", "blood culture")